Subject has anatomical structures or physiological performance that would interfere with implant utilization.

The above is a clinical trial inclusion criterion. Annotated with entity spans:
Subject has [Observation: anatomical structures] or [Observation: physiological performance] that would [Observation: interfere with] [Device: implant] utilization.